Non-compliance with DOTPlus. Alternatively DOT can be done by telephoning patient on a daily basis 5 times a week and having patient annotate taking drug in a log which would be reviewed by clinic staff

The above is a clinical trial exclusion criterion. Annotated with entity spans:
[Condition: Non-compliance] with [Procedure: DOTPlus]. [Non-query-able: Alternatively DOT can be done by telephoning patient on a daily basis 5 times a week and having patient annotate taking drug in a log which would be reviewed by clinic staff]